Clinical trial inclusion criteria:
Patients with functional dyspepsia that fulfill Rome III criteria with inadequate relief of dyspeptic symptoms
Age >18
Provision of written consent

Annotated entities:
- Condition: "functional dyspepsia"
- Qualifier: "Rome III criteria"
- Qualifier: "inadequate relief"
- Condition: "dyspeptic symptoms"
- Person: "Age"
- Value: ">18"
- Informed_consent: "Provision of written consent"